Clinical trial exclusion criterion:
1. High risk profiles for ischemic adverse events such as A. ST-segment elevation myocardial infarction (STEMI) B. Patients with cardiogenic shock or concomitant severe decompensated heart failure C. Myocardial infarction or stent thrombosis in spite of the maintenance of antiplatelet therapy D. Restenosis in stented segments or previous sites of balloon angioplasty 2. Patients who cannot follow allocated DAPT schedule due to the planned surgery or elective procedure within 3 months after the stenting 3. Recent history of major surgery or evident events of gastrointestinal bleeding within 1 month from the procedure 4. Patients on anticoagulation therapy with warfarin or other anticoagulants 5. Life expectancy less than 1 year (such as malignancies or other chronic systemic diseases) 6. Pregnant women 7. Past history of allergy or other contraindications for the following medications/materials: aspirin, clopidogrel, heparin, cobalt chromium, sirolimus

Annotated entities:
- Line: "1. High risk profiles for ischemic adverse events such as A. ST-segment elevation myocardial infarction (STEMI) B. Patients with cardiogenic shock or concomitant severe decompensated heart failure C. Myocardial infarction or stent thrombosis in spite of the maintenance of antiplatelet therapy D. Restenosis in stented segments or previous sites of balloon angioplasty"
- Line: "2. Patients who cannot follow allocated DAPT schedule due to the planned surgery or elective procedure within 3 months after the stenting"
- Line: "3. Recent history of major surgery or evident events of gastrointestinal bleeding within 1 month from the procedure"
- Line: "4. Patients on anticoagulation therapy with warfarin or other anticoagulants"
- Line: "5. Life expectancy less than 1 year (such as malignancies or other chronic systemic diseases)"
- Line: "6. Pregnant women"
- Line: "7. Past history of allergy or other contraindications for the following medications/materials: aspirin, clopidogrel, heparin, cobalt chromium, sirolimus"
- Condition: "ischemic adverse events"
- Condition: "High risk profiles"
- Condition: "ST-segment elevation myocardial infarction (STEMI)"
- Condition: "cardiogenic shock"
- Condition: "heart failure"
- Qualifier: "severe"
- Qualifier: "decompensated"
- Condition: "Myocardial infarction"
- Condition: "stent thrombosis"
- Drug: "antiplatelet therapy"
- Condition: "Restenosis"
- Mood: "planned"
- Procedure: "surgery"
- Qualifier: "elective"
- Procedure: "procedure"
- Temporal: "within 3 months after the stenting"
- Condition: "cannot follow allocated DAPT schedule"
- Procedure: "major surgery"
- Condition: "events of gastrointestinal bleeding"
- Temporal: "within 1 month from the procedure"
- Procedure: "anticoagulation therapy"
- Drug: "warfarin"
- Qualifier: "other"
- Drug: "anticoagulants"
- Observation: "Life expectancy"
- Value: "less than 1 year"
- Condition: "malignancies"
- Condition: "chronic systemic diseases"
- Qualifier: "other"
- Condition: "Pregnant"
- Person: "women"
- Condition: "allergy"
- Condition: "contraindications"
- Qualifier: "other"
- Drug: "aspirin"
- Drug: "clopidogrel"
- Drug: "heparin"
- Drug: "cobalt chromium"
- Drug: "sirolimus"